Autoimmune, rheumatologic or inflammatory disease which are not psoriasis or psoriatic arthritis

The above is a clinical trial exclusion criterion. Annotated with entity spans:
Autoimmune, rheumatologic or [Condition: inflammatory disease] which are [Negation: not] [Condition: psoriasis] or [Condition: psoriatic arthritis]